Clinical trial inclusion criterion:
18 years of age or older

Entity relations:
- Has_value("age", "older 18 years")